Clinical trial exclusion criterion:
Total cholesterol =300 mg/dL

Annotated entities:
- Measurement: "Total cholesterol"
- Value: "=300 mg/dL"